Current involvement in psychotherapy;

The above is a clinical trial exclusion criterion. Annotated with entity spans:
Current involvement in [Procedure: psychotherapy];